小兒過敏引發氣喘，是現今台灣臨床上頗為普遍的病症，請問下列何種節肢動物為臨床上造成小兒氣喘最常見之致敏原？
A. 恙蟎（chigger）
B. 家塵蟎（house dust mite）
C. 蜱（tick）
D. 體蝨（Pediculuc humanus）

正確答案：B. 家塵蟎（house dust mite）